關於血脂治療之敘述，下列何者錯誤？
A. fibric acid衍生物是治療血中三酸甘油脂（triglyceride）過高之第一線用藥
B. statin是治療血中膽固醇（cholesterol）過高之第一線用藥
C. fibric acid衍生物與Statin合併使用可能造成橫紋肌溶解症（rhabdomyolysis）
D. fibric acid衍生物與Statin嚴禁合併使用

正確答案：D. fibric acid衍生物與Statin嚴禁合併使用